What is the link between lithium use during pregnancy and Ebstein anomaly?

It is generally believed that lithium use is associated with increased risk of Ebstein anomaly. However, more recent studies challenge this association.